Clinical trial inclusion criterion:
Karnofskcy performance status (KPS) >_70%.

Annotated entities:
- Measurement: "Karnofskcy performance status (KPS)"
- Value: ">_70%"